下列有關光波物理性質之敘述，何者錯誤？
A. 各種顏色不同波長之光波在真空中的速度是一樣的
B. 不同波長之色光在一般介質的速度是不一樣的
C. 光線在一般介質的折射係數（index of refraction）均大於1
D. ＋1D（屈光度，diopter）透鏡的焦距（focal length）定為一公尺，則＋2D鏡片的焦距為兩公尺

正確答案：D. ＋1D（屈光度，diopter）透鏡的焦距（focal length）定為一公尺，則＋2D鏡片的焦距為兩公尺